人體內那一種抗體濃度增加，容易引起第一型過敏反應？
A. IgA
B. IgE
C. IgG
D. IgM

正確答案：B. IgE